Recent cerebrovascular accident

The above is a clinical trial exclusion criterion. Annotated with entity spans:
[Temporal: Recent] [Condition: cerebrovascular accident]